Patients who are anticipated to receive treatment or surgery that may require desisting the administration of antiplatelet therapy for 2 weeks or longer during the period of the clinical trial

The above is a clinical trial exclusion criterion. Annotated with entity spans:
Patients who are [Mood: anticipated to] receive [Procedure: treatment] or [Procedure: surgery] that may require desisting the administration of [Procedure: antiplatelet therapy] [Temporal: for 2 weeks or longer] during the period of the clinical trial